就解剖位置而言，食道有三個狹窄部位，下列何者錯誤？
A. cricopharyngeus muscle 處
B. 食道與左主支氣管交會處
C. 食道與肺靜脈交會處
D. 食道與橫膈膜交會處

正確答案：C. 食道與肺靜脈交會處